Clinical trial exclusion criterion:
Positive test at screening for anti-HIV, anti-HCV.

Annotated entities:
- Value: "Positive"
- Measurement: "test for anti-HIV"
- Measurement: "test for anti-HCV"
- Temporal: "at screening"